一位 20 歲女性，主訴最近數週兩側臉頰有紅斑，陽光曝曬後症狀會加劇，合併有口腔潰瘍及手指關節腫痛，實驗室檢查發現 anti-nuclear antibody 抗體價為 1:1280 (+)，anti-ds DNA 抗體價為 1:20 (+)，此病人的診斷為：
A. 全身性紅斑性狼瘡（systemic lupus erythematosus）
B. 硬皮症（scleroderma）
C. 多形性紅斑（erythema multiforme）
D. 皮肌炎（dermatomyositis）

正確答案：A. 全身性紅斑性狼瘡（systemic lupus erythematosus）